Clinical trial exclusion criterion:
Any metabolic disease bone disease that has not been stabilized for at least three months (e.g., Paget's disease, osteomalacia, osteogenesis imperfecta, thyroid and/or parathyroid gland disorder, etc.).

Entity relations:
- Has_negation("been stabilized", "not")
- Has_context("metabolic disease", "been stabilized")
- Has_temporal("been stabilized", "for at least three months")
- Subsumes("metabolic disease", "Paget's disease")
- OR("Paget's disease", "parathyroid gland disorder", "osteomalacia", "osteogenesis imperfecta", "thyroid")
- OR("metabolic disease", "bone disease")